Clinical trial inclusion criterion:
toxicity, intolerance or virological failure if receiving an NNRTI containing regimen at screening

Entity relations:
- AND("NNRTI containing regimen", "NNRTI")
- AND("NNRTI containing regimen", "toxicity")
- OR("toxicity", "intolerance", "virological failure")